Clinical trial exclusion criterion:
Diagnosed or treated for another malignancy within 2 years before study enrollment or previously diagnosed with another malignancy and have any evidence of residual disease. Participants with non-melanoma skin cancer or carcinoma in situ of any type are not excluded if they have undergone complete resection.

Annotated entities:
- Condition: "malignancy"
- Temporal: "within 2 years before study enrollment"
- Temporal: "previously"
- Qualifier: "another"
- Condition: "malignancy"
- Condition: "residual disease"
- Mood: "any evidence of"
- Condition: "non-melanoma skin cancer"
- Condition: "carcinoma in situ"
- Qualifier: "any type"
- Negation: "not excluded"
- Procedure: "complete resection"